Patients with active central nervous system (CNS) disease defined as symptomatic meningeal lymphoma or known CNS parenchymal lymphoma.

The above is a clinical trial exclusion criterion. Annotated with entity spans:
Patients with active [Condition: central nervous system (CNS) disease] defined as [Qualifier: symptomatic] [Condition: meningeal lymphoma] or known [Condition: CNS parenchymal lymphoma].